某國際性研究調查全世界 50 個國家的女性（15－49歲）生育率（fertility rate, 以Y表示）與已婚婦女避孕率 （percentage contraception, 以X表示）的關係，利用簡單線性迴歸得到Y＝6.8-0.08X，且Y與X的Pearson 相關係數為 -0.4，下列敘述何者正確？
A. 已婚婦女避孕率每增加一單位，平均生育率的值會增加 6.8
B. 生育率的變異有 40% 可以被已婚婦女避孕率解釋
C. 生育率的變異有 16% 可以被已婚婦女避孕率解釋
D. 已婚婦女避孕率每增加一單位，平均生育率的值會降低 0.4

正確答案：C. 生育率的變異有 16% 可以被已婚婦女避孕率解釋